Blasts < 1,000/µL in peripheral blood (PB) on day 8

The above is a clinical trial inclusion criterion. Annotated with entity spans:
[Line: Blasts < 1,000/µL in peripheral blood (PB) on day 8]